Clinical trial exclusion criterion:
Nocturnal oxygen therapy.

Annotated entities:
- Procedure: "Nocturnal oxygen therapy"